下列降血壓藥物中，何者使血管舒張的機轉主要是抑制鈣離子內流入平滑肌細胞？
A. aliskiren
B. carvedilol
C. doxazosin
D. felodipine

正確答案：D. felodipine